Clinical trial inclusion criterion:
Anticipated discontinuation of clopidogrel or ticagrelor within the 12 month follow up period, example for elective surgery

Entity relations:
- Has_mood("elective surgery", "example for")
- Has_temporal("clopidogrel", "within the 12 month follow up period")
- OR("clopidogrel", "ticagrelor")
- OR("clopidogrel", "elective surgery")